Clinical trial inclusion criterion:
ECOG performance status < 2

Entity relations:
- Has_value("ECOG performance status", "< 2")